Clinical trial exclusion criterion:
Inability to obtain consent from patient or patients kin

Annotated entities:
- Informed_consent: "Inability to obtain consent from patient or patients kin"